Patient may take an inhibitor of proton pump equivalent to 2 times 40 mg of esomeprazole,

The above is a clinical trial inclusion criterion. Annotated with entity spans:
[Non-representable: Patient may take an inhibitor of proton pump equivalent to 2 times 40 mg of esomeprazole],